Clinical trial exclusion criterion:
Have a history of myocardial infarction in the past 6 months

Entity relations:
- Has_temporal("myocardial infarction i", "past 6 months")